Clinical trial inclusion criterion:
High risk patients: General Surgery AKI Risk Index Class III, IV or V

Entity relations:
- Has_value("General Surgery AKI Risk Index", "Class III, IV or V")
- Subsumes("High risk", "General Surgery AKI Risk Index")